飢餓時，下列何者是增加血糖濃度最重要的酵素？
A. 肌細胞之 glycogen phosphorylase
B. 肝臟細胞之 glycogen phosphorylase
C. 肌細胞之 lactate dehydrogenase
D. 肝臟細胞之 pyruvate kinase

正確答案：B. 肝臟細胞之 glycogen phosphorylase